Clinical trial inclusion criterion:
undergoing unilateral mastectomy with or without axillary node dissection

Entity relations:
- Has_temporal("unilateral mastectomy", "undergoing")
- AND("unilateral mastectomy", "axillary node dissection")